Other conditions regimented at investigators' discretion.

The above is a clinical trial exclusion criterion. Annotated with entity spans:
[Non-query-able: Other conditions regimented at investigators' discretion].